Clinical trial exclusion criterion:
elevated risk for volume depletion, e.g. history of severe volume depletion that required medical therapy

Annotated entities:
- Observation: "risk for volume depletion,"
- Qualifier: "elevated"